Clinical trial exclusion criterion:
Patients who are medically unstable, patients who are seriously or terminally ill, and patients whose clinical course is unpredictable. For example:

Entity relations:
- OR("medically unstable", "terminally ill", "clinical course is unpredictable", "seriously ill")